Clinical trial exclusion criterion:
Fulminant hepatic failure.

Annotated entities:
- Condition: "hepatic failure"
- Qualifier: "Fulminant"